Clinical trial inclusion criterion:
ACT score <20 at screening visit.

Annotated entities:
- Measurement: "ACT score"
- Value: "<20"
- Temporal: "at screening visit"